HBV treatment ongoing at the day of inclusion

The above is a clinical trial exclusion criterion. Annotated with entity spans:
[Procedure: HBV treatment] ongoing at the day of inclusion